Clinical trial exclusion criterion:
Patients unable to give consent

Annotated entities:
- Informed_consent: "Patients unable to give consent"